Clinical trial exclusion criterion:
patients with hypovolemic shock;

Annotated entities:
- Condition: "hypovolemic shock"